El flujo linfático desde los pies:
1. Aumenta al ponerse de pie.
2. Aumenta por compresión externa.
3. Aumenta al disminuir la permeabilidad capilar.
4. Disminuye durante la inspiración.
5. Disminuye por el ejercicio.

Respuesta correcta: 2. Aumenta por compresión externa.